Clinical trial exclusion criterion:
NSTE-ACS with cardiogenic shock warranting emergent salvage surgery within 12 hrs from hospital admission

Annotated entities:
- Condition: "NSTE-ACS"
- Condition: "cardiogenic shock"
- Procedure: "salvage surgery"
- Mood: "warranting"
- Temporal: "within 12 hrs from hospital admission"
- Reference_point: "hospital admission"